咀嚼肌的本體感覺（proprioception）主要傳入下列核區？
A. 三叉神經脊髓核（spinal trigeminal nucleus）
B. 面神經運動核（facial motor nucleus）
C. 三叉神經中腦核（mesencephalic trigeminal nucleus）
D. 孤立束核（solitary nucleus）

正確答案：C. 三叉神經中腦核（mesencephalic trigeminal nucleus）